Clinical trial inclusion criterion:
Seronegative for antibodies against insulin, islet cells and glutamic acid decarboxylase (GAD);

Annotated entities:
- Negation: "Seronegative"
- Condition: "antibodies"
- Qualifier: "insulin"
- Qualifier: "islet cells"
- Qualifier: "glutamic acid decarboxylase (GAD)"